Clinical trial exclusion criterion:
23. Use of investigational medications within 30 days before study entry

Annotated entities:
- Parsing_Error: "23."
- Drug: "investigational medications"
- Undefined_semantics: "investigational medications"
- Temporal: "within 30 days before study entry"
- Reference_point: "study entry"